有一位60歲男性病人發現僅右側鎖骨上窩有一個4公分之硬塊，下列何者是最有可能的原發病灶？
A. 鼻咽癌
B. 口腔癌
C. 攝護腺癌
D. 鼻竇癌

正確答案：C. 攝護腺癌